Clinical trial exclusion criterion:
Patients participating in another clinical trial within 1 month

Annotated entities:
- Competing_trial: "Patients participating in another clinical trial within 1 month"